Clinical trial exclusion criterion:
No major surgery requiring general anaesthesia for at least 3 months prior to the screening visit.

Annotated entities:
- Condition: "major surgery"
- Undefined_semantics: "major surgery"
- Procedure: "general anaesthesia"
- Temporal: "for at least 3 months prior to the screening visit"
- Reference_point: "the screening visit"
- Negation: "No"
- Grammar_Error: "No"